No prior prostate radiation or other definitive therapy

The above is a clinical trial inclusion criterion. Annotated with entity spans:
[Negation: No] prior [Procedure: prostate radiation] or other [Procedure: definitive therapy]